先生 32 歲，太太 30 歲。太太第一次懷孕時，在第 22 週發現胎兒有複雜先天性心臟病，因此終止該次懷孕。該胎兒之染色體檢查為 46,XY。此次為第二次懷孕之第 18 週。下列處理何者最適當？
A. 告知胎兒發生染色體異常機會較高，可接受羊膜腔穿刺檢查（amniocentesis）
B. 告知胎兒發生基因突變機會較高，可接受羊膜腔穿刺檢查
C. 告知胎兒發生先天性心臟病機會較高，可接受超音波檢查
D. 夫妻接受染色體檢查，若是夫妻之一有染色體異常，胎兒染色體異常機會較高，必須接受羊膜腔穿刺檢查

正確答案：C. 告知胎兒發生先天性心臟病機會較高，可接受超音波檢查